¿Cuál de las siguientes enzimas actúa en la ruta de las pentosas fosfato?:
1. Aldolasa.
2. Glucosa 6-fosfato deshidrogenasa.
3. Glucógeno fosforilasa.
4. Fosfofructoquinasa-1.
5. Piruvato quinasa.

Respuesta correcta: 2. Glucosa 6-fosfato deshidrogenasa.